Clinical trial inclusion criterion:
Subject must have been on maintenance therapy (Fixed dose combination ICS/LABA) for 3 months, cannot have changed dose in the month prior to screening and be able to change to an equivalent dose of RELVAR/BREO for the duration of the study. Other background asthma medication such as anti-leukotrienes and oral corticosteroids are permitted provided the dose has been stable for 1 month prior to screening.

Entity relations:
- Has_multiplier("combination ICS/LABA", "Fixed dose")
- Subsumes("maintenance therapy", "combination ICS/LABA")
- Has_temporal("maintenance therapy", "for 3 months")
- Has_negation("changed dose", "cannot")
- Has_index("in the month prior to screening", "the month prior to screening")
- Has_multiplier("maintenance therapy", "changed dose")
- Has_temporal("changed dose", "in the month prior to screening")